Clinical trial inclusion criteria:
submucosal,
intramural or subserosal leiomyomas,
symptoms of menometrorrhagia,
menstrual disorder,
infertility,
pelvic pain

Annotated entities:
- Condition: "submucosal"
- Condition: "subserosal leiomyomas"
- Condition: "intramural leiomyomas"
- Mood: "symptoms"
- Condition: "menometrorrhagia"
- Condition: "menstrual disorder"
- Condition: "infertility"
- Condition: "pelvic pain"